patients' refusal

The above is a clinical trial exclusion criterion. Annotated with entity spans:
[Post-eligibility: patients' refusal]